Clinical trial inclusion criterion:
Diagnosed with Beta-Thalassemia Major and receiving regular blood transfusion and on iron chelating therapy.

Entity relations:
- Has_qualifier("blood transfusion", "regular")
- AND("Beta-Thalassemia Major", "blood transfusion")
- Has_qualifier("iron chelating therapy", "regular")
- AND("Beta-Thalassemia Major", "iron chelating therapy")